Clinical trial exclusion criterion:
Pregnant and/or nursing mothers.

Entity relations:
- OR("Pregnant", "nursing")